Subjects who have been treated with clozapine or long-acting injectable antipsychotic drugs within 3 months prior to the screening.

The above is a clinical trial exclusion criterion. Annotated with entity spans:
Subjects who have been treated with [Drug: clozapine] or [Drug: long-acting injectable antipsychotic drugs] [Temporal: within 3 months prior to the screening].